Clinical trial inclusion criterion:
5. ANC greater than 500/µL.

Entity relations:
- Has_value("ANC", "greater than 500/µL")